RTS S AS01 vaccine was developed to prevent which disease?

RTS,S/AS01 vaccine was developed for prevention of malaria.